Clinical trial exclusion criterion:
Systemic treatment, within 14 days before the first dose of ixazomib, with strong cytochrome P450 3A (CYP3A) inducers (rifampin, rifapentine, rifabutin, carbamazepine, phenytoin, phenobarbital), or use of Ginkgo biloba or St. John's wort.

Annotated entities:
- Procedure: "Systemic treatment"
- Temporal: "within 14 days before the first dose of ixazomib"
- Reference_point: "the first dose of ixazomib"
- Drug: "ixazomib"
- Drug: "strong cytochrome P450 3A (CYP3A) inducers"
- Drug: "rifampin"
- Drug: "rifapentine"
- Drug: "rifabutin"
- Drug: "carbamazepine"
- Drug: "phenytoin"
- Drug: "phenobarbital"
- Drug: "Ginkgo biloba"
- Drug: "St. John's wort"